clinically significant peripheral vascular disease (previous surgery, amputation, or symptoms of claudication)

The above is a clinical trial exclusion criterion. Annotated with entity spans:
[Qualifier: clinically significant] [Condition: peripheral vascular disease] ([Procedure: previous surgery], [Procedure: amputation], or [Condition: symptoms of claudication])